Clinical trial exclusion criterion:
Subject has abnormal long or short QT interval, signs of Brugada syndrome, known inheriting ion channel disease on the family, arrhythmogenic right ventricular dysplasia.

Annotated entities:
- Measurement: "QT interval"
- Qualifier: "abnormal"
- Value: "long"
- Value: "short"
- Condition: "Brugada syndrome"
- Condition: "inheriting ion channel disease"
- Observation: "inheriting ion channel disease on the family"
- Condition: "right ventricular dysplasia"
- Qualifier: "arrhythmogenic"